Is currently participating or has participated in a study with an investigational agent or using an investigational device within 4 weeks of the first dose of study medication

The above is a clinical trial exclusion criterion. Annotated with entity spans:
[Non-query-able: Is currently participating or has participated in a study with an investigational agent or using an investigational device within 4 weeks of the first dose of study medication]